Clinical trial inclusion criteria:
Children, aged between one and 24 months. classified as (American Society of Anesthesiologists) ASA physical status I or II, undergoing TEE were enrolled in the study.

Annotated entities:
- Person: "Children"
- Person: "aged"
- Value: "between one and 24 months"
- Measurement: "American Society of Anesthesiologists"
- Measurement: "ASA physical status"
- Value: "I or II"
- Procedure: "TEE"